Cholecystectomy or bile duct resection

The above is a clinical trial inclusion criterion. Annotated with entity spans:
[Procedure: Cholecystectomy] or [Procedure: bile duct resection]